Which is the major RNA editing enzyme in Drosophila melanogaster?

The ADAR (adenosine deaminase, RNA-specific) RNA editing enzyme controls neuronal excitability in Drosophila melanogaster.